Clinical trial exclusion criterion:
current alcohol abuse or drug dependence

Entity relations:
- Has_temporal("alcohol abuse", "current")
- OR("alcohol abuse", "drug dependence")